Clinical trial exclusion criterion:
Current (past 12 months) diagnosis of Panic disorder, Obsessive Compulsive Disorder, Posttraumatic Stress Disorder, Anorexia Nervosa, or Bulimia Nervosa.

Annotated entities:
- Condition: "Panic disorder"
- Condition: "Obsessive Compulsive Disorder"
- Condition: "Posttraumatic Stress Disorder"
- Condition: "Anorexia Nervosa"
- Condition: "Bulimia Nervosa"
- Temporal: "past 12 months"